the sound-side (contralateral) lower extremity must be free of impediments that affect gait, range of motion, or limb muscle activity

The above is a clinical trial exclusion criterion. Annotated with entity spans:
the sound-side (contralateral) [Observation: lower extremity] must be [Negation: free] of [Condition: impediments that affect gait], range of motion, or limb muscle activity